下列何者是全民健康保險自1995年開辦以後，臺灣醫療環境所發生的變遷？
A. 地區醫院數目減少
B. 基層診所數目減少
C. 惡性腫瘤死亡率，超過心臟疾病成為第一大死亡原因
D. 分級醫療及轉診制度的開始

正確答案：A. 地區醫院數目減少